下列有關於 meperidine 的敘述，何者正確？
A. 比 sufentanil 具較高脂溶性
B. 其主要代謝產物 normeperidine 具中樞神經毒性
C. 以靜脈方式給藥，其作用時間比 morphine 長
D. 其效力是 fentanyl 的十分之一

正確答案：B. 其主要代謝產物 normeperidine 具中樞神經毒性